有關攝護腺癌的敘述，下列何者錯誤？
A. High-grade prostatic intraepithelial neoplasia 可能是攝護腺癌的前驅病變
B. 好發的位置在 transitional zone
C. PSA 異常升高，可用於攝護腺癌的篩檢
D. 轉移出去的腫瘤比原發的腫瘤更常發生 p53 的突變

正確答案：B. 好發的位置在 transitional zone